Clinical trial exclusion criterion:
History of a positive Hepatitis B surface antigen (HBsAg) or Hepatitis C test result.

Entity relations:
- Has_value("Hepatitis C test", "positive")
- Has_value("Hepatitis B surface antigen (HBsAg) test", "positive")
- AND("History", "Hepatitis B surface antigen (HBsAg) test")
- OR("Hepatitis B surface antigen (HBsAg) test", "Hepatitis C test")